Legal incapacity or evidence that a subject cannot understand the purpose and risks of the study or inability to comply fully with study procedures and follow up.

The above is a clinical trial exclusion criterion. Annotated with entity spans:
L[Post-eligibility: egal incapacity or evidence that a subject cannot understand the purpose and risks of the study or inability to comply fully with study procedures and follow up].